Drug allergies to quinine sulfate or rosiglitazone

The above is a clinical trial exclusion criterion. Annotated with entity spans:
Drug [Condition: allergies] to [Drug: quinine sulfate] or [Drug: rosiglitazone]